Clinical trial inclusion criterion:
Constant habitual diet patterns within last 3 months

Entity relations:
- Has_temporal("Constant habitual diet patterns", "within last 3 months")